Clinical trial exclusion criterion:
Previous vaginal delivery.

Entity relations:
- Has_temporal("vaginal delivery", "Previous")